Clinical trial exclusion criterion:
Pregnant or lactating females.

Annotated entities:
- Condition: "Pregnant"
- Condition: "lactating"